顳動脈炎（temporal arteritis）是一種較常發生於女性的血管炎，下列敘述何者最不恰當？
A. 好發年紀大於50歲
B. 通常為單側
C. 觸診可發現顳動脈炎（temporal arteritis）的脈動增強
D. 常合併肌肉疼痛

正確答案：C. 觸診可發現顳動脈炎（temporal arteritis）的脈動增強